¿Cuál de las siguientes especies bacterianas es intrínsecamente resistente a muchos antibióticos de amplio uso en clínica?
1. Klebsiella pneumoniae.
2. Haemophilus influenzae.
3. Streptococcus pneumoniae.
4. Pseudomonas aeruginosa.

Respuesta correcta: 4. Pseudomonas aeruginosa.